Clinical trial exclusion criterion:
hormone ablation for 2 months prior to treatment or during treatment

Annotated entities:
- Procedure: "hormone ablation"
- Temporal: "for 2 months prior to treatment"
- Reference_point: "treatment"
- Temporal: "during treatment"
- Reference_point: "treatment"